Clinical trial inclusion criterion:
Serum or plasma total bilirubin less than or equal to 2.5 times the upper limit of normal

Annotated entities:
- Qualifier: "plasma"
- Qualifier: "Serum"
- Measurement: "total bilirubin"
- Value: "less than or equal to 2.5 times the upper limit of normal"